Clinical trial exclusion criterion:
history of renal, hepatic, cardiac or pulmonary severe disease

Entity relations:
- Has_qualifier("pulmonary disease", "severe")
- Has_qualifier("hepatic disease", "severe")
- Has_qualifier("hepatic disease", "severe")
- Has_qualifier("hepatic disease", "severe")
- OR("renal disease", "hepatic disease", "cardiac disease", "pulmonary disease")